Clinical trial exclusion criterion:
Patients with untreated central nervous system disease. Patients with controlled treated CNS lesions who have undergone surgery or stereotactic radiosurgery and stable for 4 weeks are eligible.

Entity relations:
- Has_qualifier("central nervous system disease", "untreated")
- Has_temporal("stable", "for 4 weeks")
- AND("CNS lesions", "surgery")
- Has_qualifier("CNS lesions", "stable")
- Has_qualifier("CNS lesions", "treated")
- Has_qualifier("CNS lesions", "controlled")
- OR("surgery", "stereotactic radiosurgery")